Clinical trial exclusion criterion:
Patients from whom informed consent cannot be obtained

Annotated entities:
- Informed_consent: "Patients from whom informed consent cannot be obtained"